A prospective subject should not be included in the study until the condition has resolved or the febrile event has subsided.

The above is a clinical trial exclusion criterion. Annotated with entity spans:
[Non-query-able: A prospective subject should not be included in the study until the condition has resolved or the febrile event has subsided.]